presence of a homogeneously echogenic effusion on pleural US27 -

The above is a clinical trial exclusion criterion. Annotated with entity spans:
presence of a [Condition: homogeneously echogenic effusion] on [Procedure: pleural US]27 -